關於阻塞性睡眠呼吸中止症（obstructive sleep apnea syndrome）之檢查與治療，下列何者正確？
A. 多項睡眠檢查（polysomnography）之異常標準為：每小時出現10次以上，每次超過5秒以上之呼吸中斷或減弱
B. 呼吸道阻塞位置最常發生在舌根
C. 鼻部連續陽壓呼吸（nasal continuous positive airway pressure）可作為大部分病人之標準治療
D. 扁桃腺與腺樣體切除（adenotonsillectomy）為成年病人治療之首選

正確答案：C. 鼻部連續陽壓呼吸（nasal continuous positive airway pressure）可作為大部分病人之標準治療